Cardiac surgery

The above is a clinical trial exclusion criterion. Annotated with entity spans:
[Procedure: Cardiac surgery]